Hypotonia

The above is a clinical trial exclusion criterion. Annotated with entity spans:
[Condition: Hypotonia]